active ocular or periocular infection

The above is a clinical trial exclusion criterion. Annotated with entity spans:
[Qualifier: active] [Condition: ocular] or [Condition: periocular infection]